What are DMARDs?

Treatment with disease-modifying antirheumatic drugs (DMARDs) was 61% (claims data) and